Essential hypertension who had never received angiotensin II receptor antagonists and calcium channel blockers

The above is a clinical trial inclusion criterion. Annotated with entity spans:
[Condition: Essential hypertension] who had [Negation: never] received [Drug: angiotensin II receptor antagonists] and [Drug: calcium channel blockers]